Clinical trial exclusion criterion:
Pregnant women or women who are uncertain about a possible pregnancy

Entity relations:
- OR("Pregnant", "possible pregnancy")